孩童泌尿道感染時，下列那一項檢查最適於評估膀胱輸尿管逆流（vesicoureteral reflux）？
A. 正子斷層攝影（PET）
B. 靜脈注射腎盂攝影（IVU）
C. 經直腸超音波掃描（transrectal ultrasonography）
D. 解尿膀胱泌尿道攝影（voiding cystourethrography）

正確答案：D. 解尿膀胱泌尿道攝影（voiding cystourethrography）